Clinical trial exclusion criterion:
Has a history of or concurrent congestive heart failure of any grade

Entity relations:
- Has_temporal("congestive heart failure", "history")
- OR("history", "concurrent")